我國於民國 91 年修正的醫師法中，增訂第 12 條之 1，規定：「醫師診治病人時，應向病人或其家屬告知其病情、治療方針、處置、用藥、預後情形及可能之不良反應。」請問，此條規定與醫師倫理守則中那一個原則相符合？
A. 尊重病人自主原則
B. 隱私保密原則
C. 不傷害原則
D. 正義原則

正確答案：A. 尊重病人自主原則